patients with coagulopathy;

The above is a clinical trial exclusion criterion. Annotated with entity spans:
patients with [Condition: coagulopathy];